Clinical trial inclusion criterion:
Clinical diagnosis of allergic rhinitis based on sneeze attacks, runny/blocked/itchy nose in the absence of a common cold during the previous 12 months.

Entity relations:
- Subsumes("allergic rhinitis", "sneeze attacks")
- Has_negation("common cold", "absence")
- Has_temporal("common cold", "during the previous 12 months")
- OR("allergic rhinitis", "runny nose")
- OR("blocked nose", "runny nose")
- OR("itchy nose", "runny nose")
- OR("blocked nose", "common cold")